腹內惡性腫瘤若轉移到肚臍下方而呈現硬塊，此稱之為：
A. Virchow's node
B. Sister Mary Joseph's node
C. Rotter's node
D. Sentinel node

正確答案：B. Sister Mary Joseph's node